Clinical trial inclusion criterion:
M1 marrow on day 33.

Entity relations:
- Has_temporal("M1 marrow", "on day 33")